Clinical trial inclusion criterion:
Cancer and Leukemia Group B (CALGB) performance status less than or equal to 2

Annotated entities:
- Measurement: "Cancer and Leukemia Group B (CALGB) performance status"
- Value: "less than or equal to 2"